關於肺結核的傳染途徑，下列敘述何者錯誤？
A. 類似流行性感冒病毒，一旦附著在呼吸道上皮就會發生感染
B. 常因吸入結核病患者所咳出之飛沫而感染
C. 通常不會經由食器傳染
D. 感染結核菌的人約只有 10%會發病

正確答案：A. 類似流行性感冒病毒，一旦附著在呼吸道上皮就會發生感染